Stroke when meeting criteria for total anterior, partial anterior or posterior circulation infarct according to the Oxford Community Stroke Project classification. Patients with clinically silent of lacunar strokes and transient ischemic attacks will not be excluded.

The above is a clinical trial exclusion criterion. Annotated with entity spans:
[Condition: Stroke] when meeting criteria for [Qualifier: total anterior], [Qualifier: partial anterior] or [Qualifier: posterior] [Condition: circulation infarct] according to the [Measurement: Oxford Community Stroke Project classification]. [Non-representable: Patients with clinically silent of lacunar strokes and transient ischemic attacks will not be excluded.]